Clinical trial exclusion criterion:
tinnitus or hearing loss with same debut as vertigo

Annotated entities:
- Condition: "tinnitus"
- Condition: "hearing loss"
- Condition: "vertigo"